下列何神經之分支，包括其節後纖維（postganglionic fibers），不出現在鼓室（tympanic cavity）中？
A. 第八顱神經
B. 第七顱神經
C. 第九顱神經
D. 交感神經

正確答案：A. 第八顱神經